當出生之後，B 淋巴細胞由下列那一器官製造？
A. 骨髓
B. 脾臟
C. 肝臟
D. 胸腺

正確答案：A. 骨髓